Any anti-diabetic agent except SGLT2 inhibitors, TZDs(thiazolidinediones), DPP4(Dipeptidyl peptidase4) inhibitors and GLP1 RAs(Glucagon-like Peptide 1-Receptor Agonists)

The above is a clinical trial inclusion criterion. Annotated with entity spans:
Any [Drug: anti-diabetic agent] [Negation: except] [Drug: SGLT2 inhibitors], [Drug: TZDs]([Drug: thiazolidinediones]), [Drug: DPP4]([Drug: Dipeptidyl peptidase4]) inhibitors and [Drug: GLP1 RAs]([Drug: Glucagon-like Peptide 1-Receptor Agonists])